Clinical trial inclusion criterion:
Patients where antibiotic therapy has already been started (prior to randomization)

Annotated entities:
- Drug: "antibiotic therapy"
- Temporal: "prior to randomization"
- Reference_point: "randomization"